Clinical trial inclusion criterion:
Orthostatic hypotension after 3-minute standing (systolic blood pressure drop >=20 or diastolic blood pressure drop >=10

Annotated entities:
- Condition: "Orthostatic hypotension"
- Qualifier: "after 3-minute standing"
- Measurement: "systolic blood pressure drop"
- Measurement: "diastolic blood pressure drop"
- Value: ">=10"
- Value: ">=20"